Mujer de 59 años que presenta diarrea crónica acuosa de 4 meses de evolución. En la endoscopia, la mucosa no mostraba aspectos relevantes. En concreto, no se observaron úlceras o áreas friables. Se realizó biopsia del colon transverso. En el estudio histopatológico se reconoció un área engrosada por debajo del epitelio de revestimiento superficial, que era más evidente mediante técnica de tricrómico de Masson y que conllevaba atrofia y denudación epitelial. También se apreció un claro incremento en la densidad de linfocitos intraepiteliales. ¿El diagnóstico de la lesión intestinal es?
1. Colitis ulcerosa cronificada.
2. Colitis pseudomembranosa.
3. Colitis colágena.
4. Enfermedad de Crohn fibrosante.

Respuesta correcta: 3. Colitis colágena.